Presence of ocular or systemic disease or need of medications which might interfere with contact lens wear.

The above is a clinical trial exclusion criterion. Annotated with entity spans:
Presence of [Undefined_semantics: ocular or systemic disease] or [Condition: need of medications] which [Qualifier: might interfere with contact lens wear].